Albumin < 3g/dL.

The above is a clinical trial exclusion criterion. Annotated with entity spans:
[Measurement: Albumin] [Value: < 3g/dL].